Clinical trial inclusion criteria:
1. Age: 12 to 36 months of age (The diagnosis of CP is often uncertain under the age of 12 months. The cutoff at 36 months is to have a population of young children when the brain is most "plastic" and most susceptible to reorganization).
2. Diagnosis: Diagnosis of spastic CP confirmed by a pediatric neurologist or pediatric rehabilitation specialist.
3. Etiology: The insult to the central nervous system that caused the motor dysfunction must have occurred during gestation or within one year after birth independent of gestational age.
4. Disease severity level: Gross Motor Function Classification System (GMFCS) levels I, II and III.

Annotated entities:
- Parsing_Error: "1."
- Person: "Age"
- Value: "12 to 36 months of age"
- Not_a_criteria: "(The diagnosis of CP is often uncertain under the age of 12 months. The cutoff at 36 months is to have a population of young children when the brain is most "plastic" and most susceptible to reorganization)"
- Parsing_Error: "2."
- Condition: "spastic CP"
- Parsing_Error: "3."
- Non-query-able: "Etiology: The insult to the central nervous system that caused the motor dysfunction must have occurred during gestation or within one year after birth independent of gestational age."
- Temporal: "one year after birth"
- Parsing_Error: "4."
- Measurement: "Gross Motor Function Classification System (GMFCS)"
- Value: "levels I, II and III"